Clinical trial inclusion criterion:
Person is >18 years old.

Annotated entities:
- Person: "old"
- Value: ">18 years"